Known intolerance to the doxycycline Body weight <40 kg Pregnancy or breastfeeding History of severe allergic reaction or anaphylaxis Alcohol or drug abuse

The above is a clinical trial exclusion criterion. Annotated with entity spans:
Known [Condition: intolerance to the doxycycline] [Measurement: Body weight] [Value: <40 kg] [Condition: Pregnancy] or [Observation: breastfeeding] [Temporal: History of] [Qualifier: severe] [Condition: allergic reaction] or [Condition: anaphylaxis] [Condition: Alcohol] or [Condition: drug abuse]